Chronic neurological lesion

The above is a clinical trial exclusion criterion. Annotated with entity spans:
[Condition: Chronic neurological lesion]